一個臨床試	評估密集運動計畫擬探討初次發病存活至少30天的心肌梗塞病人的有效性，初次發病存活至少 30天的心肌梗塞病人被隨機分配至密集運動計畫或一般照護（usual care）。在100名一般照護的病人中，30 名病人在三年的追蹤期間死亡；在100名密集運動計畫的病人中，50名病人在三年的追蹤期間死亡。密集運動
 計畫組相較於一般照護組的死亡相對危險性（relative risk of death）為何？
A. 0.60
B. 0.03
C. 0.50
D. 1.67

正確答案：D. 1.67